下列對於乳房之發炎性癌（inflammatory carcinoma）的敘述，何者正確？
A. 預後佳
B. 治療方式常須多管齊下，包括化學治療、放射線治療及手術治療
C. 在乳癌分期上，屬 TNM 系統的 T3
D. 這些患者常沒有腋下淋巴結轉移或全身其他器官轉移

正確答案：B. 治療方式常須多管齊下，包括化學治療、放射線治療及手術治療